Children who present to the PED with a rash, vomiting or current asthma symptoms including coughing, wheezing or breathing problems will also be excluded to ensure these do not mask reactions to an oral challenge.

The above is a clinical trial exclusion criterion. Annotated with entity spans:
[Person: Children] who present to the [Visit: PED] with a [Condition: rash], [Condition: vomiting] or [Temporal: current] [Condition: asthma symptoms] including [Condition: coughing], [Condition: wheezing] or [Condition: breathing problems] will also be excluded to ensure these do not mask reactions to an oral challenge.